Clinical trial exclusion criterion:
Allergy or contraindication to paracetamol, Prasugrel or Ticagrelor

Annotated entities:
- Condition: "Allergy"
- Condition: "contraindication"
- Drug: "paracetamol"
- Drug: "Prasugrel"
- Drug: "Ticagrelor"